Clinical trial exclusion criterion:
Fibrates (must be on stable dose for ≥3 months);

Entity relations:
- Has_temporal("stable dose", "≥3 months")
- Has_qualifier("Fibrates", "stable dose")